Which gene is frequently involved in autosomal dominant adult-onset demyelinating leukodystrophy (ADLD)?

Autosomal dominant leukodystrophy (ADLD) is an adult onset demyelinating disorder that is caused by duplications of the lamin B1 (LMNB1) gene.